在進行卡方檢定時，若有某一個細格之欲預期值小於或等於5，則須選用何種統計方法較為適當？
A. 簡單迴歸分析（simple regression）
B. 多變項分析（multivariate analysis）
C. 變異量分析（analysis of variance）
D. 費雪恰當檢定（Fisher's exact test）

正確答案：D. 費雪恰當檢定（Fisher's exact test）